Ann Arbor stage II,III or IV

The above is a clinical trial inclusion criterion. Annotated with entity spans:
[Measurement: Ann Arbor stage] [Value: II],[Value: III] or [Value: IV]